Newborn infants <28 weeks and >34 weeks gestation, those with life threatening illness, congenital and chromosomal anomalies, gastrointestinal anomalies or necrotizing enterocolitis and fed premature formula

The above is a clinical trial exclusion criterion. Annotated with entity spans:
[Person: Newborn infants] [Value: <28 weeks and >34 weeks] [Measurement: gestation], those with [Condition: life threatening illness], congenital and [Condition: chromosomal anomalies], [Condition: gastrointestinal anomalies] or [Condition: necrotizing enterocolitis] and [Observation: fed premature formula]